El medio que se utiliza para detectar la producción de acetoína (butilén glicol) a partir de ácido pirúvico en la fermentación de la glucosa se denomina:
1. Kigler.
2. Rojo de metilo.
3. Voges Proskauer.
4. ONPG (orto-nitrofenil-galactopiranósido)
5. Beta-glucuronidasa.

Respuesta correcta: 3. Voges Proskauer.